關於荷爾蒙避孕藥的成分，何者敘述錯誤？
A. 可以含 estrogen 加 progestin
B. 可以只含 estrogen
C. 可以只含 progestin
D. 荷爾蒙避孕藥可以口服或打針方式給予

正確答案：B. 可以只含 estrogen